Clinical trial exclusion criterion:
Allergy known to fish

Annotated entities:
- Condition: "Allergy"
- Drug: "fish"